Estimula a las células cromafines de la médula adrenal la:
1. Acetil-colina.
2. Noradrenalina.
3. Dopamina.
4. Serotonina.

Respuesta correcta: 1. Acetil-colina.